Clinical trial exclusion criterion:
History of chronic alcohol abuse and/or drug use;

Entity relations:
- Has_qualifier("alcohol abuse", "chronic")
- OR("alcohol abuse", "drug use")